What does isradipine do to L-type channels?

Isradipine antagonizes/blocks the L-type channels.